Peripheral neuropathy

The above is a clinical trial exclusion criterion. Annotated with entity spans:
[Condition: Peripheral neuropathy]